7. Unwilling or unable to cease using the following medications during the study period: Topical ocular cyclosporine (e.g. Restasis®), anti-histamines, antipsychotics, or eye gels.

The above is a clinical trial exclusion criterion. Annotated with entity spans:
[Parsing_Error: 7.] [Post-eligibility: Unwilling or unable] to cease using the following medications [Temporal: during the study period]: [Drug: Topical ocular cyclosporine] (e.g. [Drug: Restasis®]), [Drug: anti-histamines], [Drug: antipsychotics], or [Drug: eye gels].